¿Qué es lo que favorece la aparición de placas ateroscleróticas?
1. El estrés.
2. El asma.
3. La angina de pecho.
4. El cannabis.
5. El ejercicio físico.

Respuesta correcta: 1. El estrés.